Clinical trial inclusion criterion:
HB = 90g / L

Annotated entities:
- Measurement: "HB"
- Value: "= 90g / L"